Clinical trial exclusion criterion:
have a positive pregnancy test at screening, or

Annotated entities:
- Pregnancy_considerations: "have a positive pregnancy test at screening"